下列那一種真菌（fungi）通常不形成菌絲（hyphae）構造？
A. 熱帶念珠菌（Candida tropicalis）
B. 白色念珠菌（Candida albicans）
C. 光滑念珠菌（Candida glabrata）
D. 近平滑念珠菌（Candida parapsilosis）

正確答案：C. 光滑念珠菌（Candida glabrata）